Hombre de 40 años, sin antecedentes de interés, que presenta artritis aguda de rodilla derecha de 5 días de evolución así como febrícula de hasta 37.7ºC. No refiere antecedente traumático. Presenta derrame articular, calor a la palpación y limitación funcional por el dolor. Se practica artrocentesis diagnóstica en la que se evidencian 30000 cels/microL con predominio de neutrófilos. En el examen con luz polarizada se descubren cristales romboidales y cilíndricos con birrefringencia débilmente positiva. En la radiografía simple de rodillas se descubren depósitos radiodensos en el menisco externo de la rodilla. Señale la respuesta FALSA:
1. El tratamiento inicial consistirá en antiinflamatorios no esteroideos, así como la aspiración del líquido sinovial.
2. Es conveniente la realización de cultivo del líquido sinovial para descartar sinovitis infecciosa.
3. Una vez pasado el brote agudo habrá que instaurar tratamiento con alopurinol para disminuir la incidencia de nuevos brotes de artritis en el futuro.
4. El diagnóstico más probable es una artritis aguda por depósito de cristales de pirofosfato cálcico (pseudogota).

Respuesta correcta: 3. Una vez pasado el brote agudo habrá que instaurar tratamiento con alopurinol para disminuir la incidencia de nuevos brotes de artritis en el futuro.